Clinical trial exclusion criterion:
Patients with right-to-left, bi-directional, or transient right-to-left cardiac shunts

Entity relations:
- Has_qualifier("cardiac shunts", "right-to-left,")
- OR("right-to-left,", "bi-directional", "transient")